亨汀頓舞蹈症（Huntington's chorea）的三項典型症狀（Triad），不包括下列何者？
A. 自體顯性遺傳
B. 舞蹈徐動症（Choreoathetosis）
C. 肌躍症（Myoclonus）
D. 智能及認知障礙

正確答案：C. 肌躍症（Myoclonus）